一位 30 歲男性，精神分裂症患者，服用抗精神藥物後，自笑及幻聽皆有改善，但仍無法工作而賦閒在家，因而引起兄姐不滿及責罵，母親則非常保護他，且生活中每件事都幫他準備好。下列有關情緒表露之敘述，何者錯誤？
A. 此病患家庭屬於高度情緒表露（high expressed emotion）
B. 情緒表露理論是由英國學者 Julian Left 於 60 年所提出
C. 精神病患處在高度情緒表露之家庭，且與家人接觸時間每週超過 35 小時，則復發率較高
D. 低度情緒表露之家屬較會認為病患行為是疾病造成，而非自己所能控制

正確答案：B. 情緒表露理論是由英國學者 Julian Left 於 60 年所提出